Prior treatment with more than 2 cycles of carboplating-based chemotherapy regimens

The above is a clinical trial exclusion criterion. Annotated with entity spans:
[Temporal: Prior] [Procedure: treatment] with [Value: more than 2 cycles] of [Qualifier: carboplating-based] [Procedure: chemotherapy regimens]